Clinical trial exclusion criterion:
Use of supplements containing nitrates and supplements containing stimulants (such as ephedra) are exclusionary in the two weeks prior to initial screen (P1) visit and prohibited throughout the study. Participants who take these supplements will be asked to discontinue them for a minimum of two weeks before the Preliminary Screening Period (P1 visit)..

Annotated entities:
- Drug: "nitrates"
- Drug: "stimulants"
- Drug: "ephedra"
- Temporal: "in the two weeks prior to initial screen (P1) visit"